Clinical trial exclusion criterion:
Delirium at screening or baseline

Annotated entities:
- Temporal: "at screening"
- Temporal: "at baseline"
- Condition: "Delirium"